下列何者不是孕婦發生 HELLP 症候群的典型表現？
A. 溶血性貧血（Hemolytic anemia）
B. 肝功能異常
C. 低血小板數
D. 高血糖

正確答案：D. 高血糖